Primary in-utero drug exposure was opioids other than buprenorphine

The above is a clinical trial inclusion criterion. Annotated with entity spans:
Primary [Qualifier: in-utero] [Observation: drug exposure] was [Drug: opioids] [Negation: other] than [Drug: buprenorphine]